Clinical trial exclusion criterion:
Patients who have received an investigational drug in the 30 days before study drug administration, or will receive one within 72 h afterwards,.

Annotated entities:
- Non-query-able: "Patients who have received an investigational drug in the 30 days before study drug administration, or will receive one within 72 h afterwards,."